3. Evidence or history of left-sided heart disease and/or clinically significant cardiac disease in which pulmonary hypertension is more likely WHO Group 2.

The above is a clinical trial exclusion criterion. Annotated with entity spans:
[Parsing_Error: 3.] Evidence or [Temporal: history] of [Condition: left-sided heart disease] and/or [Qualifier: clinically significant] [Condition: cardiac disease] in which [Condition: pulmonary hypertension] is more likely [Measurement: WHO Group] [Value: 2].